Clinical trial inclusion criterion:
contraindication to treatment drugs,

Entity relations:
- AND("contraindication", "treatment drugs")